Clinical trial exclusion criterion:
Fasting triglycerides greater than 400 mg/dL.

Annotated entities:
- Measurement: "Fasting triglycerides"
- Value: "greater than 400 mg/dL"